Clinical trial inclusion criterion:
Dehydration

Annotated entities:
- Condition: "Dehydration"